一位 30 歲男性近來易喘，且有高血壓病史，理學檢查在左側第二肋間可聽到收縮期心雜音，心電圖顯示左心室肥厚，胸部 X 光片顯示有肋骨凹痕（rib notching）。最有可能的診斷為何？
A. 心房中隔缺損（atrial septal defect）
B. 心室中隔缺損（ventricular septal defect）
C. 開放性動脈導管（patent ductus arteriosus）
D. 主動脈狹窄（coarctation of the aorta）

正確答案：D. 主動脈狹窄（coarctation of the aorta）